Clinical trial exclusion criterion:
Assessed by the investigator to be unable or unwilling to comply with the requirements of the protocol.

Annotated entities:
- Observation: "unwilling to comply with the requirements of the protocol"
- Observation: "unable to comply with the requirements of the protocol"